What is the effect that EZH2 has on chromatin?

Ezh1 and Ezh2 maintain repressive chromatin through different mechanisms